Clinical trial exclusion criterion:
The patients have other cancers at the same time or have the history of other cancers except controlled skin basal cell carcinoma or skin squamous cell carcinoma or carcinoma in situ of cervix uterus;

Annotated entities:
- Condition: "other cancers"
- Temporal: "at the same time"
- Condition: "other cancers"
- Negation: "except"
- Condition: "controlled skin basal cell carcinoma"
- Condition: "skin squamous cell carcinoma"
- Condition: "carcinoma in situ of cervix uterus"